Clinical trial inclusion criteria:
The participant has a diagnosis of Parkinson's disease according to the diagnostic criteria of the UK Parkinson's Disease Society Brain Bank.
The participant has received a levodopa combination drug for >= 1 month and has either of the following.
Wearing off phenomenon
Decreased response to levodopa combination drugs
The participant has received a levodopa combination drug without change in the dose regimen.
The participant is an outpatient of either sex aged >= 30 and < 80 years.

Annotated entities:
- Condition: "Parkinson's disease"
- Measurement: "UK Parkinson's Disease Society Brain Bank"
- Drug: "levodopa combination"
- Temporal: ">= 1 month"
- Parsing_Error: "has either of the following."
- Condition: "Wearing off phenomenon"
- Condition: "Decreased response"
- Drug: "evodopa combination drugs"
- Drug: "levodopa combination drug"
- Qualifier: "without change in the dose regimen"
- Person: "aged"
- Value: ">= 30 and < 80 years"